Clinical trial inclusion criterion:
Patients presenting for CMR evaluation of chest pain but without evidence of obstructive coronary artery disease either by coronary angiography or stress testing.

Annotated entities:
- Condition: "chest pain"
- Negation: "without"
- Condition: "obstructive coronary artery disease"
- Procedure: "coronary angiography"
- Procedure: "stress testing"